Clinical trial exclusion criterion:
Patients above 65 years of age ( Physiology difference)

Entity relations:
- Has_value("age", "above 65 years")